No significant disease or drug use

The above is a clinical trial inclusion criterion. Annotated with entity spans:
[Negation: No] [Qualifier: significant] [Condition: disease] or [Condition: drug use]